ability to read and understand English

The above is a clinical trial inclusion criterion. Annotated with entity spans:
[Observation: ability to read] and understand English